Un proceso espontáneo se caracteriza porque:
1. En sistemas aislados la entropía disminuye (ΔS < 0).
2. A presión y temperatura constantes, la energía de Gibbs disminuye (ΔG < 0).
3. A presión y temperatura constantes, la energía de Helmholtz disminuye (ΔA < 0).
4. A volumen y temperatura constantes, la energía de Gibbs aumenta (ΔG > 0).
5. Es reversible.

Respuesta correcta: 2. A presión y temperatura constantes, la energía de Gibbs disminuye (ΔG < 0).